一 41 歲男性駕車在十字路口發生車禍，主訴胸部遭受撞擊，疑發生心包填塞（cardiac tamponade），理學檢查發現有 Kussmaul's sign，則會有下列何種表現？
A. 吸氣時靜脈壓（venous pressure）下降
B. 吸氣時靜脈壓（venous pressure）上升
C. 呼氣時靜脈壓（venous pressure）下降
D. 呼氣時靜脈壓（venous pressure）上升

正確答案：B. 吸氣時靜脈壓（venous pressure）上升